¿Cuál de los siguientes tejidos se introduce a través de la línea primitiva?
1. El sincitiotrofoblasto.
2. El citotrofoblasto.
3. El hipoblasto.
4. El epiblasto.

Respuesta correcta: 4. El epiblasto.